Clinical trial inclusion criterion:
Birth weight > 2500g

Annotated entities:
- Measurement: "Birth weight"
- Value: "> 2500g"